在考慮到先天性代謝性疾病時，下列那種疾病較容易陰離子差距（anion gap）增高，pH 值偏酸而血氨升高？
A. phenylketonuria
B. methylmalonic acidemia
C. marple syrup urine disease
D. ornithine decarboxylase deficiency

正確答案：B. methylmalonic acidemia